實施全民健康保險的目的，不包括下列何者？
A. 增進人民健康
B. 保障疾病治療所衍生之財務風險
C. 有錢有能力者多繳保費，協助弱勢之人口群
D. 保障生病時可治癒之天賦人權

正確答案：D. 保障生病時可治癒之天賦人權